Clinical trial exclusion criterion:
ruptured membranes

Annotated entities:
- Condition: "ruptured membranes"